Clinical trial exclusion criterion:
Patients with genetic problems such as galactose intolerance, Lapp lactase deficiency or glucose-galactose malabsorption, since this study drug contains lactose

Annotated entities:
- Condition: "genetic problems"
- Condition: "galactose intolerance"
- Condition: "Lapp lactase deficiency"
- Condition: "glucose-galactose malabsorption"